List 3 indications for Bupropion

Bupropion is used to treat Obesity, for smoking cessation and for depression